下列有關乳房腫瘤粗針（core needle）穿刺檢查之敘述，何者錯誤？
A. 用 14 號、16 號或 18 號針頭（14、16 or 18 gauge needle）穿刺
B. 須局部麻醉
C. 可避免再作腫瘤切片（tumor biopsy）
D. 無法獲得 ER、PR 及 HER2/neu 之資訊

正確答案：D. 無法獲得 ER、PR 及 HER2/neu 之資訊